Active symptomatic urinary infection

The above is a clinical trial exclusion criterion. Annotated with entity spans:
[Qualifier: Active] [Qualifier: symptomatic] [Condition: urinary infection]